Clinical trial inclusion criterion:
AFC> 10

Annotated entities:
- Measurement: "AFC"
- Value: "> 10"